Se considera que dos fármacos son bioequivalentes cuando:
1. Contienen el mismo principio activo, aunque cambien los excipientes.
2. Su vida media biológica, semivida o t½, no difiere en más de un 5%.
3. Los procesos de biotransformación metabólica tienen lugar a través de las mismas isoformas enzimáticas.
4. Presentan una biodisponibilidad similar.

Respuesta correcta: 4. Presentan una biodisponibilidad similar.